Clinical trial inclusion criterion:
Patients should have at least 12 teeth present

Annotated entities:
- Condition: "teeth present"
- Multiplier: "at least 12"